Age between 20 and 40 years

The above is a clinical trial inclusion criterion. Annotated with entity spans:
[Person: Age] [Value: between 20 and 40 years]